with a history of mental illness and/or family history of mental illness limb disabled.

The above is a clinical trial exclusion criterion. Annotated with entity spans:
with a [Temporal: history] of [Condition: mental illness] and/or [Observation: family history] of [Condition: mental illness] [Qualifier: limb disabled].